52歲男性病人，在坐起來的時候，比躺下時有較低血氧症（orthodeoxia）及呼吸困難（platypnea），此位病 人最可能罹患下列何種疾病？
A. 睡眠呼吸中止症候群
B. 心臟衰竭
C. 肝硬化併門脈高壓
D. 氣喘

正確答案：C. 肝硬化併門脈高壓